Clinical trial exclusion criterion:
2. Osteoporosis with high risk of pathological fracture

Annotated entities:
- Parsing_Error: "2."
- Condition: "Osteoporosis"
- Qualifier: "high risk of pathological fracture"
- Subjective_judgement: "high risk of pathological fracture"
- Undefined_semantics: "high risk of pathological fracture"
- Non-query-able: "high risk of pathological fracture"